Clinical trial exclusion criterion:
Has Presbyopia or has dependence on spectacles for near work over the contact lenses.

Annotated entities:
- Condition: "Presbyopia"
- Condition: "dependence on spectacles for near work"